Una mezcla de un ácido fuerte HA y otro débil HB se valora con NaOH. El valor de pH en el primer punto de equivalencia:
1. Viene dado por la hidrólisis del anión A-.
2. Viene dado por la disociación ácida de HB.
3. Depende de las concentraciones relativas de A- y HB.
4. No depende de la fuerza relativa del ácido HB.

Respuesta correcta: 2. Viene dado por la disociación ácida de HB.